Best corrected visual acuity 20/32 - 20/320

The above is a clinical trial inclusion criterion. Annotated with entity spans:
[Measurement: Best corrected visual acuity] [Value: 20/32 - 20/320]